下列何者氧分壓最高？
A. 肺泡（alveolus）
B. 肺泡微血管（alveolar capillary）內血液
C. 體動脈血（systemic arterial blood）
D. 呼出氣體（expired air）

正確答案：D. 呼出氣體（expired air）